Clinical trial inclusion criteria:
Arrestees examined by a physician during detention in police cells
aged 18 or older
smoking at least 10 cigarettes per day
giving written consent to participate in the study
health status compatible with detention in police cells

Annotated entities:
- Person: "Arrestees"
- Temporal: "during detention in police cells"
- Reference_point: "detention in police cells"
- Procedure: "examined by a physician"
- Value: "18 or older"
- Person: "aged"
- Observation: "smoking"
- Multiplier: "at least 10 cigarettes per day"
- Informed_consent: "giving written consent to participate in the study"
- Value: "compatible with detention in police cells"
- Measurement: "health status"